Follicle stimulating hormone > 20 IU/L

The above is a clinical trial exclusion criterion. Annotated with entity spans:
[Measurement: Follicle stimulating hormone] [Value: > 20 IU/L]